Clinical trial inclusion criteria:
definite unilateral vestibulopathy
no pathological HINTS (examination criteria in acute vestibular syndrome)
capable of making their own decisions

Annotated entities:
- Condition: "vestibulopathy"
- Qualifier: "unilateral"
- Negation: "no"
- Condition: "HINTS"
- Qualifier: "pathological"
- Condition: "acute vestibular syndrome"
- Post-eligibility: "capable of making their own decisions"